Clinical trial exclusion criterion:
Active or recent history (= 1 year) of drug or alcohol abuse

Entity relations:
- Has_temporal("drug abuse", "= 1 year")
- OR("drug abuse", "alcohol abuse")